下列那些麻醉相關設備，在核磁共振攝影室內進行全身麻醉時可以安全使用？①blood pressure cuff  ②Macintosh laryngoscope ③cardiac defibrillator ④oximeter probe
A. 僅①②③
B. ①②③④
C. 僅①④
D. 僅②③④

正確答案：C. 僅①④